En un paciente con cirrosis hepática y ascitis, que desarrolla un derrame pleural con los siguientes datos en el líquido pleural: LDH 45 U/L (sérica 220 U/L), cociente proteínas pleura/suero 0,3 y cociente LDH pleura/suero 0,2. ¿Cuál sería la actitud adecuada?
1. Debe ampliarse el estudio del líquido con recuento celular, glucosa, pH, ADA, colesterol y cultivo.
2. Biopsia pleural ciega.
3. Videotoracoscopia diagnóstica.
4. Antibioterapia empírica por sospecha de derrame paraneumónico.
5. Continuar el tratamiento de su hepatopatía.

Respuesta correcta: 5. Continuar el tratamiento de su hepatopatía.